決定慢性重度二尖瓣閉鎖不全（severe mitral regurgitation）病人是否應接受手術治療，下列何者為最優先考量因素？
A. 左心室收縮功能
B. 左心室收縮末期直徑
C. 是否有症狀
D. 是否適合二尖瓣修補術

正確答案：C. 是否有症狀